Clinical trial exclusion criterion:
9. Prior enrollment failure or randomization in this study.

Annotated entities:
- Condition: "enrollment failure"
- Non-query-able: "Prior enrollment failure or randomization in this study."